Clinical trial inclusion criterion:
No prior chemotherapy for their metastatic breast cancer (MBC).

Entity relations:
- Has_temporal("chemotherapy", "prior")
- Has_negation("chemotherapy", "No")
- AND("chemotherapy", "metastatic breast cancer (MBC)")